Has a known history of human immunodeficiency virus (HIV)

The above is a clinical trial exclusion criterion. Annotated with entity spans:
Has a known [Temporal: history] of [Condition: human immunodeficiency virus (HIV)]